Clinical trial exclusion criterion:
Currently pregnant or breastfeeding

Annotated entities:
- Condition: "pregnant"
- Temporal: "Currently"
- Observation: "breastfeeding"